AMP-activated protein kinase（AMPK）在活化後，主要會促進下列那一種反應途徑？
A. gluconeogenesis
B. lipid biosynthesis
C. glycolysis
D. cholesterol synthesis

正確答案：C. glycolysis